Clinical trial exclusion criterion:
Medical contraindications to SSRI therapy as determined by history (including induction of mania or hypomania during SSRI therapy, or known drug allergy)

Entity relations:
- Has_temporal("mania", "during SSRI therapy")
- Has_temporal("contraindications to SSRI therapy", "history")
- multi("contraindications to SSRI therapy", "SSRI therapy")
- Subsumes("contraindications to SSRI therapy", "mania")
- OR("mania", "hypomania")
- OR("mania", "drug allergy")